What is the nucleotide composition of the Lamin Associated Domains (LADs)?

Instead, cLADs are universally characterized by long stretches of DNA of high A/T content. Analysis of paralogs suggests that during evolution changes in A/T content have driven the relocation of genes to and from the nuclear lamina, in tight association with changes in expression level